What is the active ingredient in the most common hand sanitizer?

The active ingredients in most hand sanitizers include ethanol, benzalkonium chloride, isopropanol, alcohol, bzk, 70% ethanol and soap.